Clinical trial exclusion criterion:
Advanced male factor infertility.

Annotated entities:
- Qualifier: "Advanced"
- Condition: "male factor infertility"